有關肝膿瘍之敘述，何者不正確？
A. 阿米巴肝膿瘍患者黃疸比化膿性肝膿瘍常見
B. 血清中的鹼性磷酸酶（alkaline phosphatase）可能急劇上升
C. 位置通常在右側肝臟
D. 化膿性肝膿瘍的致病菌最常見的是 Escherichia coli 和 Klebsiella pneumoniae

正確答案：A. 阿米巴肝膿瘍患者黃疸比化膿性肝膿瘍常見